Clinical trial exclusion criterion:
Type 1 diabetes, as defined by ADA criteria

Entity relations:
- Has_qualifier("Type 1 diabetes", "ADA criteria")